What is the gene ABCG1 encoding?

ABCG1 is an ATP binding cassette (ABC) transporter that removes excess cholesterol from peripheral tissues.